Los métodos angulares de evaluación de las propiedades de flujo de sólidos pulverulentos permiten la determinación del parámetro ángulo de reposo. Una mezcla de sustancias pulverulentas presenta un flujo bueno u óptimo si los valores de este parámetro (en grados) son de:
1. Mayores de 40.
2. Entre 45 y 55.
3. Entre 38 y 45.
4. Mayores de 37.
5. Cercanos o menores de 25.

Respuesta correcta: 5. Cercanos o menores de 25.